有關中心視網膜靜脈阻塞（central retinal vein occlusion）的敘述，下列何者錯誤？
A. 常發生於罹患高血壓的老年人
B. 症狀為伴隨疼痛的視力喪失
C. 抽菸是危險因子之一
D. 眼底常見靜脈擴張、視網膜出血及水腫

正確答案：B. 症狀為伴隨疼痛的視力喪失